Lifetime personal history of diagnosis of major depressive disorder according to the DSM-V (American Psychiatric Association, 2013) using the Structured Clinical Interview for DSM-V Axis I Disorders, Research Version, Non-patient Edition (SCID-5-RV for DSM-V; First et al., 2015)

The above is a clinical trial exclusion criterion. Annotated with entity spans:
Lifetime personal history of diagnosis of [Condition: major depressive disorder] according to the [Qualifier: DSM-V] (American Psychiatric Association, 2013) using the [Procedure: Structured Clinical Interview for DSM-V Axis I Disorders, Research Version, Non-patient Edition] (SCID-5-RV for DSM-V; First et al., 2015)